Participation in other interventional research.

The above is a clinical trial exclusion criterion. Annotated with entity spans:
[Non-query-able: Participation in other interventional research.]